某醫院育嬰室之 25 歲護士，回家後出現流鼻水、輕微咳嗽及稍微發燒現象，此狀況延續了數天，咳嗽變的更嚴重，並發出"吠"的聲音，激動時會有喘鳴聲。除此之外，該護士看來無異樣，除了一直 咳嗽，經 X 光檢查發現頸部內下聲門明顯變窄。此症狀由下列何種病毒感染所引起？
A. 副流行性感冒病毒（Parainfluenza virus）
B. 流行性感冒病毒（Influenza virus）
C. 呼吸道細胞融合病毒（Respiratory syncytial virus）
D. 鼻病毒（Rhinovirus）

正確答案：A. 副流行性感冒病毒（Parainfluenza virus）